Clinical trial exclusion criterion:
endometrial thickness < 7 mm or no triple layer endometrium and/or functional follicles

Annotated entities:
- Measurement: "endometrial thickness"
- Value: "< 7 mm"
- Negation: "no"
- Observation: "triple layer endometrium"
- Observation: "functional follicles"